Clinical trial exclusion criterion:
Use of antipsychotics or mood stabilizers within 5 days prior to screening.

Entity relations:
- Has_temporal("antipsychotics", "within 5 days prior to screening")
- Has_index("within 5 days prior to screening", "screening")
- OR("antipsychotics", "mood stabilizers")